Clinical trial inclusion criterion:
1. Patient is over 18 years old.

Annotated entities:
- Value: "over 18 years old"
- Person: "years old"